Clinical trial exclusion criterion:
Women with history of breast cancer or breast surgery in the same quadrant

Entity relations:
- Has_qualifier("breast surgery", "same quadrant")
- Has_qualifier("breast cancer", "same quadrant")
- OR("breast cancer", "breast surgery")